有關診斷腹痛之理學檢查的敘述，下列何者正確？
A. psoas sign 及 obturator sign 為診斷急性闌尾炎之充分必要條件
B. 泛腹膜炎常合併有全腹反彈痛及腸蠕音增加
C. Courvoisier's sign 陽性指在黃疸病患觸摸到疼痛性膽囊
D. Grey Turner sign 表示病患可能有急性出血性胰臟炎

正確答案：D. Grey Turner sign 表示病患可能有急性出血性胰臟炎